previous pelvic surgeries

The above is a clinical trial exclusion criterion. Annotated with entity spans:
[Temporal: previous] [Procedure: pelvic surgeries]